Platelet count: ≥ 100,000/mm3

The above is a clinical trial inclusion criterion. Annotated with entity spans:
[Measurement: Platelet count]: [Value: ≥ 100,000/mm3]